一病患有非常嚴重的鞭蟲（Trichuris trichiura）感染。下列臨床症狀，何者最不可能發生？
A. 腹痛
B. 貧血
C. 肺炎
D. 闌尾炎

正確答案：C. 肺炎